IUD or Depo PLUS a barrier contraceptive

The above is a clinical trial inclusion criterion. Annotated with entity spans:
[Device: IUD] or [Device: Depo] PLUS a [Device: barrier contraceptive]